Clinical trial exclusion criterion:
Earlier allergic reactions to glucocorticosteroid or local anesthetic.

Annotated entities:
- Condition: "allergic reactions"
- Drug: "glucocorticosteroid"
- Drug: "local anesthetic"
- Temporal: "Earlier"